Clinical trial inclusion criterion:
Fibroscan showing cirrhosis or results > 12.5 kPa

Entity relations:
- AND("Fibroscan", "cirrhosis")
- OR("cirrhosis", "> 12.5 kPa")